Which disease is treated with ZMapp?

ZMapp is a combination of antibodies for treatment of Ebola virus disease.